Cervical spine injury with functional loss in the upper extremity

The above is a clinical trial inclusion criterion. Annotated with entity spans:
[Condition: Cervical spine injury] with [Observation: functional loss] in the [Qualifier: upper extremity]